Clinical trial exclusion criterion:
Treprostinil contraindications: Known hypersensitivity to treprostinil or any of the excipients, Pulmonary arterial hypertension related to veno-occlusive disease, Congestive heart failure due to severe left ventricular dysfunction, Severe hepatic insufficiency (Child-Pugh stage C), Evolving gastrointestinal ulcer, intracranial hemorrhage, recent trauma or other clinical condition that may lead to bleeding, Congenital or acquired valvular abnormalities with cardiac repercussions, Severe ischemic heart disease or unstable angina; Myocardial infarction in the last six months; Decompensated cardiac insufficiency not medically controlled; Severe arrhythmias; Cerebrovascular lesions (such as transient ischemic attack, stroke) that occurred within the last three months.

Annotated entities:
- Drug: "Treprostinil"
- Condition: "contraindications"
- Condition: "hypersensitivity"
- Drug: "treprostinil"
- Drug: "any of the excipients"
- Condition: "Pulmonary arterial hypertension"
- Condition: "veno-occlusive disease"
- Condition: "Congestive heart failure"
- Condition: "left ventricular dysfunction"
- Qualifier: "severe"
- Condition: "hepatic insufficiency"
- Qualifier: "Severe"
- Measurement: "Child-Pugh"
- Value: "stage C"
- Condition: "gastrointestinal ulcer"
- Condition: "intracranial hemorrhage"
- Condition: "trauma"
- Temporal: "recent"
- Condition: "clinical condition that may lead to bleeding"
- Undefined_semantics: "clinical condition that may lead to bleeding"
- Condition: "Congenital valvular abnormalities"
- Condition: "acquired valvular abnormalities"
- Qualifier: "with cardiac repercussions"
- Condition: "ischemic heart disease"
- Qualifier: "Severe"
- Condition: "unstable angina"
- Condition: "Myocardial infarction"
- Temporal: "in the last six months"
- Condition: "Decompensated cardiac insufficiency"
- Condition: "arrhythmias"
- Qualifier: "Severe"
- Condition: "Cerebrovascular lesions"
- Condition: "transient ischemic attack"
- Condition: "stroke"
- Temporal: "within the last three months"